Clinical trial inclusion criterion:
At the discretion of the operating surgeon, Bilirubin level of < 2.0 mg/dl in the absence of a history of Gilbert's disease (or pattern consistent with Gilbert's).

Annotated entities:
- Subjective_judgement: "At the discretion of the operating surgeon"
- Measurement: "Bilirubin level"
- Value: "< 2.0 mg/dl"
- Condition: "Gilbert's disease"
- Negation: "in the absence of"
- Temporal: "history"